Which multiple kinase inhibitors are used in cancer therapy?

Multiple kinase inhibitors used in cancer therapy include ZD6474, SU11248, AEE 788, sorafenib, vatalanib, and AG-013736.